Clinical trial inclusion criterion:
Clinical condition of the patient allows to carry out induction therapy: ECOG performance status: ≤ 2 and the Hematopoietic Cell Transplant-Co-morbidity Index (HCT-I): ≤3

Annotated entities:
- Measurement: "ECOG performance status"
- Value: "≤ 2"
- Measurement: "Hematopoietic Cell Transplant-Co-morbidity Index (HCT-I)"
- Value: "≤3"